HbA1c between 7.1% and 11.0%, inclusive.

The above is a clinical trial inclusion criterion. Annotated with entity spans:
[Measurement: HbA1c] [Value: between 7.1% and 11.0%, inclusive].